Clinical trial exclusion criterion:
Active or history of any clinically significant medical condition including renal, hepatic, pulmonary, gastrointestinal, cardiovascular, genitourinary, endocrine, immunologic, metabolic, neurologic, psychiatric or hematological disease, based on Investigator judgment.

Annotated entities:
- Condition: "medical condition"
- Qualifier: "clinically significant"
- Subjective_judgement: "clinically significant"
- Undefined_semantics: "clinically significant"
- Temporal: "history"
- Temporal: "Active"
- Condition: "disease renal"
- Condition: "hematological disease"
- Condition: "psychiatric disease"
- Condition: "neurologic disease"
- Condition: "metabolic disease"
- Condition: "disease immunologic"
- Condition: "disease endocrine"
- Condition: "disease genitourinary"
- Condition: "disease cardiovascular"
- Condition: "disease gastrointestinal"
- Condition: "disease pulmonary"
- Condition: "disease hepatic"
- Qualifier: "based on Investigator judgment"
- Subjective_judgement: "based on Investigator judgment"
- Non-query-able: "based on Investigator judgment"